Clinical trial exclusion criterion:
A first degree relative (for example, mother, father, brother, sister) who had a heart condition before the age of 50

Entity relations:
- Has_value("age", "50")
- multi("age of 50", "age")
- Has_index("before the age of 50", "age of 50")
- Has_temporal("heart condition", "before the age of 50")
- AND("A first degree relative", "heart condition")
- Subsumes("A first degree relative", "mother")
- OR("mother", "father", "brother", "sister")